Clinical trial exclusion criteria:
Has other dermatological conditions that may interfere with clinical assessments
Allergy or sensitivity to corticosteroids or any drug hypersensitivity or intolerance that would compromise patient safety or study results
History of an adverse reaction to Cortrosyn™ or similar test reagents
Chronic infectious disease, system or organ disorder or other medical condition that would place patient at undue risk by study participation

Annotated entities:
- Subjective_judgement: "Has other dermatological conditions that may interfere with clinical assessments"
- Qualifier: "corticosteroids"
- Condition: "drug hypersensitivity"
- Condition: "drug intolerance"
- Condition: "Allergy"
- Condition: "sensitivity"
- Subjective_judgement: "hat would compromise patient safety or study results"
- Drug: "corticosteroids"
- Condition: "adverse reaction"
- Qualifier: "Cortrosyn"
- Drug: "Cortrosyn"
- Procedure: "test reagents"
- Qualifier: "similar"
- Qualifier: "similar test reagents"
- Subjective_judgement: "Chronic infectious disease, system or organ disorder or other medical condition that would place patient at undue risk by study participation"